Clinical trial exclusion criterion:
use of any other investigational or non-registered drug or vaccine during the study period or within 30 days preceding the study vaccine

Entity relations:
- Has_qualifier("drug", "investigational")
- Has_index("during the study period", "study period")
- Has_index("within 30 days preceding the study vaccine", "study vaccine")
- Has_temporal("drug", "during the study period")
- OR("investigational", "non-registered")
- OR("drug", "vaccine")
- OR("during the study period", "within 30 days preceding the study vaccine")